Clinical trial exclusion criterion:
Patients with serious complications (e.g., infection, hepatic encephalopathy, hepatorenal syndrome, gastrointestinal bleeding.)

Annotated entities:
- Qualifier: "serious"
- Condition: "complications"
- Condition: "infection"
- Condition: "hepatic encephalopathy"
- Condition: "hepatorenal syndrome"
- Condition: "gastrointestinal bleeding"